Clinical trial exclusion criterion:
Patients that are high risk for moderate exercise based on ACSM risk classification.

Annotated entities:
- Measurement: "risk for moderate exercise"
- Value: "high"
- Measurement: "ACSM risk classification"